血管擴張、水腫、纖維蛋白（fibrin）出現，是下列何項之特徵？
A. 急性發炎
B. 慢性發炎
C. 乾性壞疽
D. 肉芽腫性發炎

正確答案：A. 急性發炎